El suelo de la cavidad amniótica es el:
1. Trofoblasto.
2. Hipoblasto.
3. Epiblasto.
4. Endometrio.
5. Miometrio.

Respuesta correcta: 3. Epiblasto.